History of PCV-13 vaccination

The above is a clinical trial exclusion criterion. Annotated with entity spans:
[Temporal: History] of [Procedure: PCV-13 vaccination]